Clinical trial inclusion criterion:
Children between the ages of 4-18 with incomplete ASIA C or D spinal cord injuries at least 12 months before study enrolment

Entity relations:
- Has_value("ages", "4-18")
- Has_value("ASIA", "C or D")
- AND("spinal cord injuries", "ASIA")
- Has_qualifier("spinal cord injuries", "incomplete")
- multi("at least 12 months before study enrolment", "study enrolment")
- Has_temporal("spinal cord injuries", "at least 12 months before study enrolment")